一位 10 歲小孩，自嬰兒以來即歷經多次肺炎及腦膜炎併發菌血症。小孩並無肝脾腫大或身體外觀之缺陷。病人貧血，血小板及白血球數略高。血色素電泳結果為 Hb A2 1%，Hb F 7%以及 Hb S 92%。 病人容易經常感染的原因為何？
A. 內皮細胞與紅血球間的黏附（adhesion）減少
B. 免疫球蛋白的製造減少
C. 嗜中性白血球的功能減少
D. 脾臟因多次缺血性壞死，造成功能喪失

正確答案：D. 脾臟因多次缺血性壞死，造成功能喪失